How can PEGylation improve recombinant drugs?

PEGylation primarily improves pharmacokinetics and helps to prevent adverse drug reactions, by increasing the molecular mass of proteins and peptides and shielding them from proteolytic enzymes.